Un procedimiento para identificar problemas de salud es mediante el acuerdo de personas que tienen información cualificada sobre la comunidad. Dos de las técnicas más frecuentemente empleadas son:
1. El cuestionario y los programas.
2. Las técnicas por indicadores y por criterios.
3. La técnica Delphi y la técnica del Grupo Nominal.
4. El cuestionario y el forum comunitario.
5. Todas las respuestas anteriores son correctas.

Respuesta correcta: 3. La técnica Delphi y la técnica del Grupo Nominal.